Clinical trial inclusion criterion:
Intra parenchymatous hematoma

Entity relations:
- Has_qualifier("hematoma", "Intra parenchymatous")